下列有關新生兒狼瘡（neonatal lupus）的敘述，何者錯誤？
A. 因來自母親的抗體而造成症狀
B. 會導致血小板降低、皮疹和肝炎
C. 有時心臟傳導的問題需要裝人工節律器
D. 需要積極使用類固醇治療

正確答案：D. 需要積極使用類固醇治療